Clinical trial exclusion criterion:
Desire for conception in the next 12 months

Annotated entities:
- Mood: "Desire"
- Observation: "conception"
- Temporal: "in the next 12 months"